當我們運用社會行銷理論規劃一項健康促進活動時，那一個策略是屬於行銷策略？
A. 訊息相容性（information compatibility）
B. 群眾區隔（audience segmentation）
C. 團體效能（collective efficacy）
D. 後果期待（outcome expectation）

正確答案：B. 群眾區隔（audience segmentation）